La tricoleucemia (leucemia de células peludas) presenta como rasgos característicos clínicobiológicos:
1. Linfocitosis en sangre periférica superior a 50.000 linfocitos /microL.
2. Marcadores de línea linfoide T.
3. Eritrodermia generalizada exfoliativa, placas y tumores cutáneos.
4. Pancitopenia y esplenomegalia.

Respuesta correcta: 4. Pancitopenia y esplenomegalia.